Clinical trial exclusion criteria:
previous brain surgery;
cognitive impairment (< 120 points on the Mattis Dementia Rating Scale)
moderate-to-severe depression (> 25 points on the Beck Depression Inventory)
marked brain atrophy as detected by magnetic resonance imaging
other medical or psychiatric coexisting disorders that could increase the surgical risk or interfere with completion of the trial

Annotated entities:
- Temporal: "previous"
- Procedure: "brain surgery"
- Condition: "cognitive impairment"
- Value: "< 120 points"
- Measurement: "Mattis Dementia Rating Scale"
- Qualifier: "moderate-to-severe"
- Condition: "depression"
- Value: "> 25 points"
- Measurement: "Beck Depression Inventory"
- Condition: "brain atrophy"
- Procedure: "magnetic resonance imaging"
- Post-eligibility: "other medical or psychiatric coexisting disorders that could increase the surgical risk or interfere with completion of the trial"